Any physical or intellectual disability adversely affecting ability to complete assessments

The above is a clinical trial exclusion criterion. Annotated with entity spans:
Any [Condition: physical] or [Condition: intellectual disability] adversely affecting ability to complete assessments